下列有關流行性感冒病毒（Influenza virus）之敘述，何者錯誤？
A. 其外套膜上有兩個病毒的基因產物，即血球凝集素（hemagglutinin, HA）以及神經胺酸（neuraminidase,
B. HA 及 NA 可以決定流行性感冒病毒的抗原性
C. HA 可以造成紅血球凝集
D. NA 可以和此病毒之細胞受器（receptor），即唾液酸（sialic acid）結合

正確答案：D. NA 可以和此病毒之細胞受器（receptor），即唾液酸（sialic acid）結合